下列有關廣節裂頭絛蟲（Diphyllobothrium latum）的敘述，何者錯誤？
A. 蟲卵具有卵蓋（operculum）
B. 長尾幼蟲（plerocercoid）具感染人體之能力
C. 感染人體會引起缺鐵性貧血
D. 生活史須經過兩個中間宿主的發育過程

正確答案：C. 感染人體會引起缺鐵性貧血